Clinical trial exclusion criterion:
Donation or loss of 400 mL or more of blood within 8 weeks prior to dosing.

Annotated entities:
- Value: "400 mL or more"
- Temporal: "within 8 weeks prior"
- Procedure: "Donation of blood"
- Condition: "loss of blood"